Patients treated by a calcineurin inhibitor and mycophenolic acid

The above is a clinical trial inclusion criterion. Annotated with entity spans:
Patients treated by a [Drug: calcineurin inhibitor] and [Drug: mycophenolic acid]